Clinical trial exclusion criterion:
Other ocular pathologies that in the investigator's opinion would interfere with the subject's vision in the study eye.

Annotated entities:
- Qualifier: "Other"
- Condition: "ocular pathologies"
- Observation: "would interfere with the subject's vision in the study eye"
- Non-query-able: "in the investigator's opinion"